What is formin associated with in the snail?

Formin is associated with Left-Right asymmetry in the pond snail and the frog.